下列有關anti-CCP（anti-cyclic citrullinated peptide antibody）之敘述，何者錯誤？
A. 多出現在類風濕性關節炎（RA）病患
B. 一般而言此抗體高低與RA疾病的嚴重度相關
C. 此CCP之形成，是由精氨酸（arginine）經由PAD酶轉換成瓜氨酸（citrulline）
D. 使用anti-TNFα治療RA，anti-CCP抗體不會下降

正確答案：D. 使用anti-TNFα治療RA，anti-CCP抗體不會下降